Participation in any ongoing investigational drug trial/study or clinical drug trial/study

The above is a clinical trial exclusion criterion. Annotated with entity spans:
[Competing_trial: Participation in any ongoing investigational drug trial/study or clinical drug trial/study]